Clinical trial inclusion criterion:
having primary corrective heart surgery

Annotated entities:
- Qualifier: "primary"
- Procedure: "corrective heart surgery"